Clinical trial exclusion criterion:
Use of NAC prior to trial (< 1 month of planned surgery)

Annotated entities:
- Drug: "NAC"
- Temporal: "prior to trial"
- Reference_point: "trial"
- Temporal: "< 1 month"
- Mood: "planned"
- Procedure: "surgery"